下列何種藥物不會通過胎盤膜（placental membrane）？
A. 四環素（tetracycline）
B. 肝素（heparin）
C. 視黃酸（retinoic acid）
D. 胰島素（insulin）

正確答案：B. 肝素（heparin）